Clinical trial inclusion criterion:
Patient aged 18 years or older.

Entity relations:
- Has_value("aged", "18 years or older")